Clinical trial exclusion criterion:
Known contact with an INH or rifampin resistant case

Entity relations:
- AND("resistant", "INH")
- OR("INH", "rifampin")